Pseudomonas aeruginosa es:
1. Capaz de fermentar una gran variedad de azúcares.
2. A menudo resistente a muchos antibióticos de uso médico.
3. Responsable de toxi-infecciones alimentarias.
4. Parte de la microbiota normal de la piel.
5. Una bacteria comensal del tracto digestivo.

Respuesta correcta: 2. A menudo resistente a muchos antibióticos de uso médico.